Has had esophageal or gastric variceal bleeding within the last 6 months

The above is a clinical trial exclusion criterion. Annotated with entity spans:
Has had [Condition: esophageal] or [Condition: gastric variceal bleeding] [Temporal: within the last 6 months]